Clinical trial inclusion criterion:
Good general health

Annotated entities:
- Condition: "Good general health"